Clinical trial inclusion criterion:
Age between 20 and 80 years

Annotated entities:
- Person: "Age"
- Value: "between 20 and 80 years"